下列藥物中何者可以靜脈給藥，而且最常用於手術後疼痛的治療？
A. ketorolac
B. meloxicam
C. sumatriptan
D. dextromethorphan

正確答案：A. ketorolac